Daily use of of antioxidants >300mg

The above is a clinical trial exclusion criterion. Annotated with entity spans:
[Multiplier: Daily use] of of [Drug: antioxidants] [Multiplier: >300mg]